Explain amniotic band syndrome.

Amniotic band syndrome is a rare congenital disorder caused by entrapment of fetal parts in fibrous amniotic bands.